current use of smokeless tobacco, tobacco cigarettes (5 and fewer a day)

The above is a clinical trial exclusion criterion. Annotated with entity spans:
current use of [Procedure: smokeless tobacco], [Procedure: tobacco cigarettes] ([Multiplier: 5 and fewer a day])